Clinical trial exclusion criterion:
Liver disease,

Annotated entities:
- Condition: "Liver disease"